Clinical trial inclusion criterion:
Total RLS severity score of 15 or greater on the IRLS rating scale at Visit 1 (screening) and at Visit 2 (baseline) (Appendix 8).

Entity relations:
- Has_value("Total RLS severity score", "15 or greater")